Treated with a stable dose of one of the following for at least 3 months prior to screening: * >=1000 mg/day immediate-release metformin; or metformin >=1000 mg/day and sulfonylurea; or sulfonylurea/metformin combination therapy.

The above is a clinical trial inclusion criterion. Annotated with entity spans:
Treated with a [Qualifier: stable dose] of [Multiplier: one of the following] for [Temporal: at least 3 months prior to screening]: * [Value: >=1000 mg/day] [Drug: immediate-release metformin]; or [Drug: metformin] [Value: >=1000 mg/day] and [Drug: sulfonylurea]; or [Drug: sulfonylurea]/[Drug: metformin] [Procedure: combination therapy].